Good oral tolerance

The above is a clinical trial inclusion criterion. Annotated with entity spans:
[Qualifier: Good] [Condition: oral tolerance]